La pérdida de MHC clase I hace a las células susceptibles a la lisis por:
1. Linfocitos NK.
2. Linfocitos Tc.
3. Macrófagos.
4. Linfocitos Th.
5. Complemento.

Respuesta correcta: 1. Linfocitos NK.